¿Cuál de las siguientes sustancias es usada como catalizador en el Proceso de Contacto durante la fabricación de ácido sulfúrico?:
1. RuO2.
2. V2O5.
3. Cr2O3.
4. RhO2.
5. PdO.

Respuesta correcta: 2. V2O5.